Subject with symptomatic postural hypotension (severe dizziness or fainting

The above is a clinical trial exclusion criterion. Annotated with entity spans:
Subject with [Qualifier: symptomatic] [Condition: postural hypotension] ([Qualifier: severe] [Condition: dizziness] or [Condition: fainting]